下列有關 descending necrotizing mediastinitis 之敘述，何者錯誤？
A. 大部分是因為 odontogenic infection 所引起
B. 因重力及縱膈腔的負壓，讓口腔及頸部的感染物質轉移到縱膈腔所引起
C. 治療通常不需要引流術
D. 通常培養出來的細菌與口腔正常菌有關

正確答案：C. 治療通常不需要引流術